Clinical trial inclusion criteria:
Duration of SCI =1 year;
Level of SCI C3-T1, AIS A & B;
Age between 18 and 65 years.

Annotated entities:
- Condition: "SCI"
- Temporal: "=1 year"
- Measurement: "Level of SCI"
- Value: "C3-T1"
- Measurement: "AIS"
- Value: "A & B"
- Person: "Age"
- Value: "between 18 and 65 years"